Clinical trial inclusion criterion:
Subject must have symptoms that are consistent with vasospastic angina with planned Coronary angiography and Provocation test.

Entity relations:
- Has_mood("Coronary angiography", "planned")
- AND("vasospastic angina", "Coronary angiography")
- AND("vasospastic angina", "symptoms")
- Has_mood("Provocation test", "planned")
- AND("vasospastic angina", "Provocation test")